Weight: equal to or over 35 kg.

The above is a clinical trial inclusion criterion. Annotated with entity spans:
[Person: Weight]: [Value: equal to or over 35 kg].